Clinical trial inclusion criterion:
Provide with written informed consent

Annotated entities:
- Post-eligibility: "Provide with written informed consent"